下列關於鎖骨中段骨折（midshaft clavicular fracture）與鎖骨遠端骨折（distal clavicular fracture）之敘述，何者錯誤？
A. 鎖骨遠端骨折（distal clavicular fracture）比鎖骨中段骨折（midshaft clavicular fracture）常見
B. 鎖骨遠端骨折（distal clavicular fracture）接受保守治療的不癒合率（nonunion rate）比鎖骨中段骨折（midshaft clavicular fracture）高
C. 大部分的鎖骨中段骨折（midshaft clavicular fracture）使用保守治療，可獲得不錯的癒合率（union rate）
D. 根據Neer's classification，在第二型鎖骨遠端骨折（type II distal clavicular fracture）中，喙鎖韌帶（coracoclavicular ligament）會從近端骨段剝離

正確答案：A. 鎖骨遠端骨折（distal clavicular fracture）比鎖骨中段骨折（midshaft clavicular fracture）常見